Which database associates human noncoding SNPs with their three-dimensional interacting genes?

3DSNP is a database for linking human noncoding SNPs to their three-dimensional interacting genes. It a valuable resource for the annotation of human noncoding genome sequence and investigating the impact of noncoding variants on clinical phenotypes.